AF secondary to electrolyte imbalance, thyroid disease, or reversible or non-cardiac cause.

The above is a clinical trial exclusion criterion. Annotated with entity spans:
[Condition: AF] [Qualifier: secondary] to [Condition: electrolyte imbalance], [Condition: thyroid disease], or [Qualifier: reversible] or [Condition: non-cardiac cause].